Clinical trial exclusion criterion:
Serum creatinine > 1.5 mg/dL

Entity relations:
- Has_value("Serum creatinine", "> 1.5 mg/dL")